Clinical trial exclusion criterion:
Progressive neurological or neuromuscular disorders having a major impact on exercise capacity

Annotated entities:
- Condition: "disorders Progressive neurological"
- Condition: "neuromuscular disorders Progressive"
- Condition: "impact on exercise capacity"